右側眼睛照光造成左側眼睛瞳孔縮小，下列何者不參與其傳導？
A. 視徑（optic tract）
B. 睫狀神經節（ciliary ganglion）
C. 內縱束（medial longitudinal fasciculus）
D. 動眼神經（oculomotor nerve）

正確答案：C. 內縱束（medial longitudinal fasciculus）